Documented allergy to oxycodone, morphine sulfate or acetaminophen

The above is a clinical trial exclusion criterion. Annotated with entity spans:
Documented [Condition: allergy] to [Drug: oxycodone], [Drug: morphine sulfate] or [Drug: acetaminophen]